The participant has received a levodopa combination drug for >= 1 month and has either of the following.

The above is a clinical trial inclusion criterion. Annotated with entity spans:
The participant has received a [Drug: levodopa combination] drug for [Temporal: >= 1 month] and [Parsing_Error: has either of the following.]